Any concomitant medical condition that, according to the clinical site investigator would contraindicate participation in the study.

The above is a clinical trial exclusion criterion. Annotated with entity spans:
[Post-eligibility: Any concomitant medical condition that, according to the clinical site investigator would contraindicate participation in the study].